Clinical trial exclusion criterion:
Patients with pre-treatment with steroid injections/or local anesthetics.

Entity relations:
- OR("steroid injections", "local anesthetics")